導致家族性高膽固醇血症（familial hypercholesterolemia）的原因是：
A. 在肝臟細胞膜上 LDL 受體的缺陷
B. 膽固醇和肝臟的細胞外基質（matrix）的附著力降低
C. 膽固醇不能有效地被腸胃細胞所吸收
D. 膽固醇進入紅血球的主動運輸被抑制

正確答案：A. 在肝臟細胞膜上 LDL 受體的缺陷